Clinical trial inclusion criterion:
3. Clear amniotic fluid

Annotated entities:
- Parsing_Error: "3."
- Observation: "Clear amniotic fluid"